Not using medically approved contraception (including abstinence) if female and of childbearing age

The above is a clinical trial inclusion criterion. Annotated with entity spans:
[Negation: Not] using [Qualifier: medically approved] [Procedure: contraception] (including [Procedure: abstinence]) if [Person: female] and of [Person: childbearing age]